Allergy/intolerance to any of the components of medications used in the treatment.

The above is a clinical trial exclusion criterion. Annotated with entity spans:
[Condition: Allergy]/[Condition: intolerance] to any of the [Drug: components of medications used in the treatment].